Clinical trial inclusion criterion:
Maximal inspiratory pressure (MIP) <70% of predicted;

Annotated entities:
- Measurement: "Maximal inspiratory pressure (MIP)"
- Value: "<70% of predicted"